Clinical trial inclusion criteria:
chronic obstructive pulmonary disease (COPD), GOLD grade 2-3
residents at low altitude (<800 m)

Annotated entities:
- Condition: "chronic obstructive pulmonary disease"
- Condition: "COPD"
- Measurement: "GOLD grade"
- Value: "2-3"
- Non-query-able: "residents at low altitude (<800 m)"